Clinical trial inclusion criterion:
ASA class 1-4

Entity relations:
- Has_value("ASA class", "1-4")